Clinical trial exclusion criterion:
Pregnancy (positive B-HCG test performed a maxima 72h before) or breastfeeding

Annotated entities:
- Condition: "Pregnancy"
- Measurement: "B-HCG test"
- Value: "positive"
- Observation: "breastfeeding"
- Temporal: "a maxima 72h before"